下列何者非法洛氏四合症（tetralogy of Fallot）之診斷要件？
A. 心室中隔缺損
B. 右心室肥厚
C. 主動脈跨位（overriding of aorta）
D. 左心室肥厚

正確答案：D. 左心室肥厚